Clinical trial exclusion criterion:
Need of renal replacement therapy

Annotated entities:
- Procedure: "renal replacement therapy"
- Mood: "Need"